下列何者不是由受精卵發育而來？ 	-
A. 臍帶（umbilical cord）
B. 羊膜（amnion）
C. 蛻膜（decidua）
D. 絨毛膜（chorion）

正確答案：C. 蛻膜（decidua）